下列有關生物統計的敘述何者正確？
A. 以平均值來表達集中趨勢不會受到極端值之影響
B. 自變項與依變項都是類別變項時，以 ANOVA 檢定最佳
C. 自變項與依變項都是等距變項時，可以使用線性迴歸（linear regression）
D. 自變項是類別變項，依變項是等距變項時，以卡方檢定為佳

正確答案：C. 自變項與依變項都是等距變項時，可以使用線性迴歸（linear regression）